Clinical trial exclusion criteria:
1. Unable to ambulate at least 150 feet prior to stroke, or experienced intermittent claudication while walking;
2. history of congestive heart failure, unstable cardiac arrhythmias, hypertrophic cardiomyopathy, severe aortic stenosis, angina or dyspnea at rest or during ADL's;
3. History of oxygen dependence;
4. Preexisting neurological disorders, dementia or previous stroke;
5. History of major head trauma;
6. Legal blindness or severe visual impairment;
7. history of psychosis or other Axis I disorder that is primary;
8. Life expectancy <1 yr.;
9. Severe arthritis or other problems that limit passive range of motion;
10. History of DVT or pulmonary embolism within 6 months;
11. Uncontrolled diabetes with recent weight loss, diabetic coma, or frequent insulin reactions;
12. Severe hypertension with systolic >200 mmHg and diastolic >110 mmHg at rest;
13. attempt of suicide in the last 2 years or at suicidal risk assessed by SCID interview;
14. Previous or current enrollment in a clinical trial to enhance motor recovery; 15) currently exercising ≥ 2 times per week (≥20 minutes);
16) Presence of non-MR compatible implants, pregnancy or severe claustrophobia.

Annotated entities:
- Parsing_Error: "1."
- Condition: "Unable to ambulate at least 150 feet"
- Temporal: "prior"
- Condition: "stroke"
- Reference_point: "stroke"
- Condition: "intermittent claudication"
- Qualifier: "while walking"
- Parsing_Error: "2."
- Temporal: "history"
- Condition: "congestive heart failure"
- Condition: "unstable cardiac arrhythmias"
- Condition: "hypertrophic cardiomyopathy"
- Condition: "severe aortic stenosis"
- Condition: "angina"
- Condition: "dyspnea at rest"
- Condition: "dyspnea during ADL's"
- Parsing_Error: "3."
- Condition: "oxygen dependence"
- Temporal: "History"
- Parsing_Error: "4."
- Condition: "neurological disorders"
- Condition: "dementia"
- Condition: "stroke"
- Temporal: "previous"
- Temporal: "Preexisting"
- Parsing_Error: "5."
- Condition: "major head trauma"
- Temporal: "History"
- Parsing_Error: "6."
- Condition: "severe visual impairment"
- Condition: "Legal blindness"
- Parsing_Error: "7."
- Condition: "psychosis"
- Condition: "Axis I disorder"
- Qualifier: "primary"
- Temporal: "history"
- Parsing_Error: "8."
- Observation: "Life expectancy"
- Value: "<1 yr"
- Parsing_Error: "9."
- Condition: "Severe arthritis"
- Condition: "problems that limit passive range of motion"
- Undefined_semantics: "problems that limit passive range of motion"
- Parsing_Error: "10."
- Condition: "DVT"
- Condition: "pulmonary embolism"
- Temporal: "within 6 months"
- Temporal: "History"
- Parsing_Error: "11."
- Condition: "diabetes"
- Qualifier: "Uncontrolled"
- Condition: "weight loss"
- Condition: "diabetic coma"
- Condition: "insulin reactions"
- Multiplier: "frequent"
- Parsing_Error: "12."
- Condition: "Severe hypertension"
- Measurement: "systolic"
- Value: ">200 mmHg"
- Measurement: "diastolic"
- Value: ">110 mmHg"
- Parsing_Error: "13."
- Condition: "attempt of suicide"
- Temporal: "in the last 2 years"
- Condition: "at suicidal risk"
- Procedure: "SCID interview"
- Parsing_Error: "14."
- Non-query-able: "Previous or current enrollment in a clinical trial to enhance motor recovery; 15) currently exercising ≥ 2 times per week (≥20 minutes)"
- Context_Error: "Previous or current enrollment in a clinical trial to enhance motor recovery; 15) currently exercising ≥ 2 times per week (≥20 minutes)"
- Parsing_Error: "16)"
- Device: "non-MR compatible implants"
- Condition: "pregnancy"
- Condition: "claustrophobia"
- Qualifier: "severe"